有關X和Y的一個簡單的線性迴歸模型的迴歸係數估計值b與X和Y的皮爾森（Pearson）相關係數估值r的敘述，下列何者錯誤？
A. 一個大的|b|與|r|值並不能確認X對Y的因果關係
B. r值一定介於-1與1之間
C. b與r值一定同正或同負（不會一正一負）
D. 如果Y和X反應變項與解釋變項的角色互換仍然有相同的b與r值

正確答案：D. 如果Y和X反應變項與解釋變項的角色互換仍然有相同的b與r值